Clinical trial inclusion criterion:
Capacity to provide informed consent before any trial-related activities

Annotated entities:
- Informed_consent: "Capacity to provide informed consent before any trial-related activities"
- Measurement: "Capacity to provide informed consent before any trial-related activities"